有關鉤蟲（hookworm）感染的敘述，下列選項何者錯誤？①十二指腸鉤蟲（Ancylostoma duodenale）僅經皮膚感染人體 ②重度感染且鐵質之攝取量不足，常引起缺鐵性貧血（iron deficiency anemia） ③感染後最早 發生的症狀為嗜伊紅性白血球增多
A. 僅①②
B. 僅①③
C. 僅②③
D. ①②③

正確答案：B. 僅①③